在下列那一種狀況之下給與一個患有先天性心臟病的新生兒使用前列腺素E1（Prostaglandin E1）維持動脈導管（Ductus arteriosus）的開放對病情最沒有幫助？
A. 上心臟型全肺靜脈回流異常合併阻塞（Supracardiac type total anomalous pulmonary venous return with
B. 嚴重主動弓窄縮（Coarctation of the aorta）
C. 肺動脈瓣閉鎖且無心室中膈缺損（Pulmonary atresia with intact ventricular septum）
D. 左心發育不全症候群（Hypoplastic left heart syndrome）

正確答案：A. 上心臟型全肺靜脈回流異常合併阻塞（Supracardiac type total anomalous pulmonary venous return with